What is the causative agent of the "Panama disease" affecting bananas?

Panama disease of banana is caused by the fungus Fusarium oxysporum f. sp. cubense.